Clinical trial exclusion criterion:
Severely or morbidly obese or higher obesity classification (BMI =36)

Annotated entities:
- Condition: "obese"
- Qualifier: "morbidly"
- Qualifier: "Severely"
- Observation: "higher obesity classification"
- Measurement: "BMI"
- Value: "=36"